Any major urological procedure in the preceding 90 days.

The above is a clinical trial exclusion criterion. Annotated with entity spans:
Any [Procedure: major urological procedure] in the [Temporal: preceding 90 days].